Clinical trial exclusion criterion:
Screening HgA1c blood test > 10.0

Entity relations:
- Has_value("HgA1c blood test", "> 10.0")
- Has_temporal("HgA1c blood test", "Screening")